Clinical trial exclusion criterion:
women undergoing cesarean section at less than 37 weeks of gestation.

Entity relations:
- Has_temporal("gestation", "less than 37 weeks")
- AND("cesarean section", "gestation")